Clinical trial exclusion criterion:
Have participated in this study previously, or any other study using exenatide or GLP-1 analogs.

Entity relations:
- AND("this study", "exenatide")
- OR("this study", "any other study")
- OR("exenatide", "GLP-1 analogs")